Decompensated liver cirrhosis (CTP score = 7).

The above is a clinical trial exclusion criterion. Annotated with entity spans:
[Condition: Decompensated liver cirrhosis] ([Measurement: CTP score] [Value: = 7]).